隱斜視（heterophoria）的診斷一般需靠下列何項檢查，才易確定？
A. cover-uncover test
B. alternate cover test
C. prism cover test
D. prism reflex test of Krimsky

正確答案：A. cover-uncover test